planned to undergo PCI recently

The above is a clinical trial inclusion criterion. Annotated with entity spans:
[Mood: planned to undergo] [Procedure: PCI] [Temporal: recently]